What is the nucleotide composition of the Lamin Associated Domains (LADs)?

Cell-type specific LADs also tend to adhere to this "A/T rule" in embryonic stem cells, but not in differentiated cells. Instead, cLADs are universally characterized by long stretches of DNA of high A/T content. Analysis of paralogs suggests that during evolution changes in A/T content have driven the relocation of genes to and from the nuclear lamina, in tight association with changes in expression level Constitutive nuclear lamina-genome interactions are highly conserved and associated with A/T-rich sequence.